Clinical trial exclusion criterion:
Urinary protein > 1 on dipstick

Entity relations:
- Has_value("Urinary protein on dipstick", "> 1")